Do not take beta-blocker, ACE inhibitor, or nitrate

The above is a clinical trial inclusion criterion. Annotated with entity spans:
[Negation: Do not] take [Drug: beta-blocker], [Drug: ACE inhibitor], or [Drug: nitrate]